¿Qué tipo de constructo es evaluado por el Inventario de Maslach?:
1. Conducta de enfermedad.
2. Conducta anormal de enfermedad.
3. Síndrome de Adaptación General.
4. Burnout.
5. Personalidad resistente.

Respuesta correcta: 4. Burnout.